What is Neuromedin U (NmU)

Neuromedin U (NmU) is a bioactive neuropeptide that is highly distributed in the central nervous system and the gastrointestinal tract. It has a number of physiological and pathophysiological roles, ranging from feeding behavior, energy metabolism, stress responses, circadian rhythmicity and inflammation.